Clinical trial exclusion criterion:
Concomitant chronic inflammatory diseases on any ocular structure

Annotated entities:
- Temporal: "Concomitant"
- Condition: "chronic inflammatory diseases"
- Qualifier: "ocular structure"